Clinical trial inclusion criterion:
Signed informed consent

Annotated entities:
- Post-eligibility: "Signed informed consent"